History of Stomach or esophagus surgery

The above is a clinical trial exclusion criterion. Annotated with entity spans:
History of [Procedure: Stomach] or [Procedure: esophagus surgery]